Clinical trial inclusion criterion:
New York Heart Association (NYHA) heart function classification is I-II grade

Annotated entities:
- Measurement: "New York Heart Association heart function classification"
- Value: "I-II grade"
- Measurement: "NYHA"